Clinical trial exclusion criterion:
Anemia (hematocrit < 34%) as measured at screening visit

Entity relations:
- Has_value("hematocrit", "< 34%")
- Subsumes("Anemia", "hematocrit")
- AND("Anemia", "screening visit")